¿Cuál de los siguientes elementos estructurales es característico de los fármacos del grupo de las ortopramidas?
1. Son anilidas con grupo propilo en orto.
2. Son benzamidas con grupo metoxi en orto.
3. Son bencenosulfonamidas con un grupo metilo en orto.
4. Son derivados de orto-halogenados de la fenotiazina.

Respuesta correcta: 2. Son benzamidas con grupo metoxi en orto.